下列何種物質無法作為葡萄糖生合成（gluconeogenesis）之前驅物？
A. 脂肪酸
B. 胺基酸
C. 甘油（glycerol）
D. 草醯乙酸（oxaloacetate）

正確答案：A. 脂肪酸